Es una enfermedad con herencia dominante ligada al cromosoma X:
1. Distrofia muscular de Duchenne.
2. Enfermedad de Fraby.
3. Fibrosis quística.
4. Hipertricosis.

Respuesta correcta: 4. Hipertricosis.